Metabolic acidosis.

The above is a clinical trial exclusion criterion. Annotated with entity spans:
[Condition: Metabolic acidosis].